男性球尿道腺（bulbourethral gland）感染發炎時，下列何者因位置關係最可能被感染？
A. 會陰淺橫肌（superficial transverse perineal muscle）
B. 球海綿體肌（bulbospongiosus muscle）
C. 外尿道括約肌（external urethral sphincter muscle）
D. 坐骨海綿體肌（ischiocavernosus muscle）

正確答案：C. 外尿道括約肌（external urethral sphincter muscle）